Clinical trial exclusion criterion:
women who are pregnant or breast feeding; women of childbearing potential who do not consent to apply at least to methods of contraception. This criterion does not apply to postmenopausal women

Entity relations:
- OR("pregnant", "breast feeding")